Clinical trial exclusion criterion:
Hyper sensibility to sirolimus formula;

Entity relations:
- AND("Hyper sensibility", "sirolimus")